Clinical trial exclusion criterion:
Alcoholism (CAGE criteria), used for detection of abusive drinkers or alcoholic, validated in the Brazilian population with sensibility of 88% and specificity of 83%, if two or more answers, among four possible, are afirmative(Mansur and Monteiro, 1983), or according to medical decision;

Entity relations:
- Has_value("CAGE criteria", "Alcoholism")
- Subsumes("Alcoholism", "CAGE criteria")